一位小腦發生血管梗塞的腦中風病人，有動作失調（ataxia）現象，在其步行訓練時，使用下列何種 行動輔具最為恰當？
A. 手杖（cane）
B. 腋下柺杖（axillary crutch）
C. 四腳手杖（quardricane）
D. 助行器（walker）

正確答案：D. 助行器（walker）